Clinical trial exclusion criterion:
Medical history of hypersensitivity to the components of the investigational products. (The components of test drug 1 and 2, including the Rhein-based drug)

Entity relations:
- AND("hypersensitivity", "components of the investigational products")
- Subsumes("components of the investigational products", "components of test drug 1")
- OR("components of test drug 1", "Rhein-based drug", "components of test drug 2")